Alcohol misuse as defined by the Alcohol Use Disorders Identification Test (AUDIT) score subjects must score > 8 (associated with harmful or hazardous drinking)

The above is a clinical trial inclusion criterion. Annotated with entity spans:
[Condition: Alcohol misuse] as defined by the [Measurement: Alcohol Use Disorders Identification Test (AUDIT) score] subjects must score [Value: > 8] (associated with harmful or hazardous drinking)